Clinical trial inclusion criteria:
estimated glomerular filtration rate (eGFR) > 60 ml/min
preserved left ventricular ejection fraction (>= 50%) on echocardiography
HEALTHY: normal cardiac structure and function on echocardiography, BP < 140/90
HYPERTENSIVE: history of BP >140/90, 1 or more antihypertensive medications, LV ejection fraction (LVEF) at least 50%, current BP < 160/90
HFpEF: physician-confirmed diagnosis of HF, symptomatic HF, LVEF at least 50%, elevated LV filling pressure by catheterization, echocardiographic criteria or B-type-natriuretic peptide > 100, current BP < 160/90

Annotated entities:
- Measurement: "estimated glomerular filtration rate (eGFR)"
- Value: "> 60 ml/min"
- Measurement: "left ventricular ejection fraction"
- Value: "preserved"
- Value: ">= 50%"
- Procedure: "echocardiography"
- Condition: "HEALTHY"
- Value: "normal cardiac structure"
- Value: "normal cardiac function"
- Procedure: "echocardiography"
- Measurement: "BP"
- Value: "< 140/90"
- Condition: "HYPERTENSIVE"
- Measurement: "BP"
- Value: ">140/90"
- Temporal: "history"
- Multiplier: "1 or more"
- Drug: "antihypertensive medications"
- Measurement: "LV ejection fraction (LVEF)"
- Value: "at least 50%"
- Temporal: "current"
- Measurement: "BP"
- Value: "< 160/90"
- Condition: "HFpEF"
- Qualifier: "physician-confirmed"
- Condition: "HF"
- Qualifier: "symptomatic"
- Condition: "HF"
- Measurement: "LVEF"
- Value: "at least 50%"
- Value: "elevated"
- Measurement: "LV filling pressure"
- Procedure: "catheterization"
- Non-representable: "echocardiographic criteria"
- Measurement: "B-type-natriuretic peptide"
- Value: "> 100"
- Measurement: "current BP"
- Value: "< 160/90"